Clinical trial exclusion criterion:
psychiatric complaints that interfere with the correct use of the devices

Entity relations:
- Has_mood("correct use of the devices", "interfere with")
- Has_context("psychiatric complaints", "correct use of the devices")